La cromatografía líquida en fase normal:
1. Emplea una columna con grupos apolares que interaccionan con la parte apolar de los analitos de forma diferencial.
2. Es un modo de operación que emplea una fase estacionaria polar con una fase móvil de baja polaridad.
3. Utiliza fases móviles altamente polares como los alcanos o cloroalcanos.
4. Es un modo de operación que emplea una superficie no polar con una fase móvil mixta acuosa/orgánica.
5. Emplea fases estacionarias con gran número de ligandos alquílicos hidrofóbicos.

Respuesta correcta: 2. Es un modo de operación que emplea una fase estacionaria polar con una fase móvil de baja polaridad.